What is the basis of the BLISS technique?

BLISS (Breaks Labeling In Situ and Sequencing) is a versatile and quantitative method for genome-wide profiling of DNA double-strand breaks (DSBs). It uses a novel Bayesian approach which represents continuous allele frequencies for both the endogenous and endogenous DSBs, while leveraging the endogenous Cpf1 methyltransferase activity of the zinc cluster as a template.